Patient must give written informed consent before participating in any study-specific procedure, randomization, or receiving investigational product.

The above is a clinical trial inclusion criterion. Annotated with entity spans:
Patient must give written [Observation: informed consent] [Temporal: before participating in any study-specific procedure, randomization, or receiving investigational product].